Clinical trial inclusion criterion:
18-85 years of age, inclusive

Entity relations:
- Has_value("age", "18-85 years")